Clinical trial exclusion criterion:
Active self harm urges

Annotated entities:
- Condition: "self harm urges"
- Temporal: "Active"